Clinical trial inclusion criterion:
Sepsis due to MDR or minimally susceptible gram-negative bacteria

Entity relations:
- Has_qualifier("Sepsis", "MDR")
- AND("minimally susceptible gram-negative bacteria", "Sepsis")